7 歲劉小妹今天早上誤食鈕釦型電池，中午被家長送至門診後，X 光檢查發現電池卡在食道上段，劉小妹無嘔吐現象亦不覺疼痛，請問下列何種處置最合適？
A. 先觀察 48 小時，看電池是否會隨排便排出
B. 先服用抗生素避免感染
C. 開予催吐劑，讓孩童吐出
D. 立即安排食道鏡取出電池

正確答案：D. 立即安排食道鏡取出電池